Clinical trial inclusion criterion:
patients with =20° passive extension deficit (PED) in metacarpophalangeal (MP) or proximal interphalangeal (PIP) joint, or TPED of =30° in MP and PIP joints of finger/fingers II-V

Annotated entities:
- Condition: "passive extension deficit (PED)"
- Qualifier: "=20°"
- Qualifier: "joint metacarpophalangeal (MP)"
- Qualifier: "proximal interphalangeal (PIP) joint"
- Condition: "TPED"
- Qualifier: "=30°"
- Qualifier: "MP"
- Qualifier: "PIP joints"
- Qualifier: "finger/fingers II-V"